Participation in other studies that may interfere with this trial

The above is a clinical trial exclusion criterion. Annotated with entity spans:
[Competing_trial: Participation in other studies that may interfere with this trial]